Clinical trial exclusion criterion:
Planning pregnancy within 2 years of study

Entity relations:
- Has_temporal("pregnancy", "within 2 years of study")
- Has_mood("pregnancy", "Planning")